Clinical trial exclusion criterion:
History of intolerance to LMWHs during HD

Annotated entities:
- Condition: "intolerance"
- Drug: "LMWHs"
- Procedure: "HD"
- Temporal: "during HD"